Clinical trial inclusion criterion:
Scheduled to undergo bilateral palatine tonsillectomy as the only procedure

Entity relations:
- Has_multiplier("palatine tonsillectomy", "only procedure")
- multi("only procedure", "procedure")
- Has_qualifier("palatine tonsillectomy", "bilateral")
- Has_mood("palatine tonsillectomy", "Scheduled to undergo")